下列那一群肌肉的收縮會造成手指以中指（middle finger）為中心外展（abduction）的動作？
A. 掌短肌（palmaris brevis）
B. 骨間背側肌（dorsal interossei）
C. 骨間掌側肌（palmar interossei）
D. 蚓狀肌（lumbricals）

正確答案：B. 骨間背側肌（dorsal interossei）